Clinical trial exclusion criteria:
Prior chemotherapy Prior treatment with gefitinib, erlotinib, or other drugs that target EGFR Patients must not be receiving any other investigational agents Any evidence of interstitial lung disease

Annotated entities:
- Procedure: "chemotherapy"
- Temporal: "Prior"
- Line: "Prior chemotherapy"
- Procedure: "treatment"
- Drug: "gefitinib"
- Temporal: "Prior"
- Drug: "erlotinib"
- Drug: "drugs that target EGFR"
- Line: "Prior treatment with gefitinib, erlotinib, or other drugs that target EGFR"
- Post-eligibility: "Patients must not be receiving any other investigational agents"
- Condition: "interstitial lung disease"